一位 53 歲男性，過去每天抽菸 20~30 支，有 20 年歷史。已 2 年未作身體檢查，來門診要求檢查，下列那一項檢查最合乎美國預防保健工作小組（USPSTF）預防保健的建議？
A. 肺功能檢查以篩檢慢性肺病
B. 胸部 X 光檢查以篩檢肺癌
C. 測量血壓，以瞭解心血管疾病風險
D. 測量眼壓以篩檢青光眼

正確答案：C. 測量血壓，以瞭解心血管疾病風險